Clinical trial inclusion criterion:
Patients must be >= 19 years of age

Annotated entities:
- Person: "age"
- Value: ">= 19 years"